Clinical trial inclusion criterion:
Patient is receiving immunosuppressive therapy or has known immunosuppressive or autoimmune disease (e.g., human immunodeficiency virus, systemic lupus erythematous, etc.)

Entity relations:
- Subsumes("autoimmune disease", "human immunodeficiency virus")
- OR("immunosuppressive therapy", "autoimmune disease", "immunosuppressive disease")
- OR("human immunodeficiency virus", "systemic lupus erythematous")